下列那一個概念不在健康信念模式的架構中？
A. 自覺行動障礙
B. 自覺罹患性
C. 自我再評價
D. 自我效能

正確答案：C. 自我再評價